一名墜樓的傷患，抵達急診時，檢查發現以下徵候：①氣管往右側偏移 ②左側胸部呼吸聲微弱 ③左側胸壁出現皮下氣腫（subcutaneous emphysema） ④收縮壓低於90 mmHg  ⑤呼吸速率每分鐘26次。則下列何種診斷最為可能？
A. 右側大量血胸（right massive hemothorax）
B. 右側張力性氣胸（right tension pneumothorax）
C. 左側張力性氣胸（left tension pneumothorax）
D. 心包膜填塞（cardiac tamponade）

正確答案：C. 左側張力性氣胸（left tension pneumothorax）